El periodo de tiempo que transcurre de dos a seis años antes de la menopausia y de dos a seis años después de ésta se denomina:
1. Perimenopausia.
2. Climaterio.
3. Postmenopausia.
4. Premenopausia.

Respuesta correcta: 2. Climaterio.